El segundo ruido cardíaco coincide con:
1. Final de la diástole ventricular.
2. Final de la diástole auricular.
3. Apertura de la válvula aórtica.
4. Sístole auricular.
5. Cierre de las válvulas semilunares.

Respuesta correcta: 5. Cierre de las válvulas semilunares.